Clinical trial exclusion criterion:
13. Subject has active sepsis.

Annotated entities:
- Condition: "sepsis"
- Temporal: "active"